下列關於 angiotensin converting enzyme inhibitors 之敘述何者正確？
A. 可藉由抑制 bradykinin 及 substance P 之生成而降血壓
B. 會造成反射性心搏過速，故不適用於治療心衰竭
C. 可以治療糖尿病腎病變（diabetic nephropathy）
D. 和留鉀利尿劑併用可以預防高血鉀症之發生

正確答案：C. 可以治療糖尿病腎病變（diabetic nephropathy）